關於三叉神經痛的敘述，下列何者正確？
A. 大部分於年輕時就發病
B. 三叉神經中以第一分枝最容易被侵犯
C. 可在臉上特定點找到可以誘發發作的區域
D. 疼痛區域常常會超過三叉神經分布的範圍

正確答案：C. 可在臉上特定點找到可以誘發發作的區域